Clinical trial exclusion criteria:
Pregnant
Meningeal signs are present
Acute angle closure glaucoma is suspected
Head trauma within the previous two weeks
Lumbar puncture within the previous two weeks
Thunderclap onset of the headache
Known allergy to one of the study drugs
History of intracranial hypertension
Is a prisoner
Patient declined informed consent
Non-English speaking patient or parent/guardian for pediatric patients
Attending provider excludes patient
Severe Dehydration

Annotated entities:
- Condition: "Pregnant"
- Condition: "Meningeal signs"
- Condition: "Acute angle closure glaucoma"
- Mood: "suspected"
- Condition: "Head trauma"
- Temporal: "within the previous two weeks"
- Procedure: "Lumbar puncture"
- Temporal: "within the previous two weeks"
- Condition: "Thunderclap onset"
- Condition: "headache"
- Condition: "allergy"
- Drug: "study drugs"
- Temporal: "History"
- Condition: "intracranial hypertension"
- Person: "prisoner"
- Negation: "declined"
- Competing_trial: "informed consent"
- Non-query-able: "Non-English speaking patient or parent/guardian for pediatric patients"
- Non-representable: "Attending provider excludes patient"
- Qualifier: "Severe"
- Condition: "Dehydration"